下列那一項有關 DNA 病毒之特性不正確？
A. 基因體可為雙股或單股
B. 必須在細胞核內複製
C. 可具套膜
D. 相較於 RNA 病毒，基因體變異性較少

正確答案：B. 必須在細胞核內複製